Uncontrolled hyperlipidemia;

The above is a clinical trial exclusion criterion. Annotated with entity spans:
[Qualifier: Uncontrolled] [Condition: hyperlipidemia];